Hyper-IgM syndrome 為何有免疫缺失？
A. 因初級免疫反應製造過多 IgM 以致有自體免疫反應發生
B. 因遺傳性的 IgM 基因過度活化
C. 因缺乏 T cell help 以致 B cell 的 antibody isotype switching 缺乏
D. 因缺乏 NADPH oxidase

正確答案：C. 因缺乏 T cell help 以致 B cell 的 antibody isotype switching 缺乏